What receptor is associated with the protein encoded by the Spätzle gene?

Spatzle (Spz) is the toll-1 receptor gene encoding a protein subunit of a multisubunit membrane protein complex that plays a central role in the remodeling of the cytoskeleton and its association with the membrane.